What is the function of the AtxA pleiotropic regulator?

The atxA gene product activates transcription of the anthrax toxin genes and is essential for virulence.